Patients with known or newly diagnosed T2D (type 2 diabetes is diagnosed according to current WHO criteria or by the use of anti-diabetic drugs)

The above is a clinical trial inclusion criterion. Annotated with entity spans:
Patients with known or newly diagnosed [Condition: T2D] (type 2 diabetes is diagnosed according to current WHO criteria or by the use of anti-diabetic drugs)